Clinical trial exclusion criterion:
No consent

Annotated entities:
- Observation: "consent"
- Negation: "No"
- Informed_consent: "No consent"